Clinical trial inclusion criterion:
8. Left ventricular ejection fraction should be at least 30%.

Entity relations:
- Has_value("Left ventricular ejection fraction", "at least 30%")